Subjects who are already on treatment with TAC, cyclosporine or any other calcineurin inhibitor for over 4 weeks within the past 12 months.

The above is a clinical trial exclusion criterion. Annotated with entity spans:
Subjects who are already on treatment with [Drug: TAC], [Drug: cyclosporine] or any other [Drug: calcineurin inhibitor] for [Multiplier: over 4 weeks] within the [Temporal: past 12 months.]